某人類學家想探討飲食習慣對人類體型的影響。二次世界大戰前的研究數據顯示：日本成年男性的平均身高為 64.0 英吋，標準差為 2.0 英吋；該人類學家在一個最近的研究中隨機選擇了 25 名日本成年男性，發現此樣本之平均身高為 66.5 英吋，標準差為 3.0 英吋。假設目前日本成年男性的身高為 µ，而 µ 的 95%信賴區間＝（X，Y），其中 X ＝ 66.5 － t × SE，請計算 SE ＝？
A. 2.0
B. 3.0
C. 2.0/5
D. 3.0/5

正確答案：D. 3.0/5